Clinical trial inclusion criterion:
Current glucose lowering therapy either mono, dual or triple of any combination of metformin, sulphonylurea, DPP-IV inhibitor, GLP-1 therapy or an SGLT2 +/- diet and exercise

Annotated entities:
- Procedure: "glucose lowering therapy"
- Drug: "metformin"
- Drug: "sulphonylurea"
- Drug: "DPP-IV inhibitor,"
- Drug: "GLP-1 therapy"
- Drug: "SGLT2"
- Observation: "diet"
- Observation: "exercise"